Uncontrolled ventricular arrhythmia

The above is a clinical trial exclusion criterion. Annotated with entity spans:
[Qualifier: Uncontrolled] [Condition: ventricular arrhythmia]